Has a HCC diagnosis confirmed by radiology, histology, or cytology (fibrolamellar, and mixed hepatocellular/cholangiocarcinoma subtypes are not eligible)

The above is a clinical trial inclusion criterion. Annotated with entity spans:
Has a [Condition: HCC] diagnosis confirmed by [Procedure: radiology], [Procedure: histology], or [Procedure: cytology] (fibrolamellar, and [Condition: mixed hepatocellular/cholangiocarcinoma subtype]s are [Negation: not eligible])